Patient previously treated with biologics.

The above is a clinical trial exclusion criterion. Annotated with entity spans:
Patient [Temporal: previously] [Procedure: treated] with [Drug: biologics].